Clinical trial exclusion criterion:
Acute heart failure

Annotated entities:
- Condition: "Acute heart failure"